IL-2 受體（receptor）由三條鏈構成，在 T 細胞被活化時，那一條鏈大量表現而構成高親和力的 IL-2 受體？
A. α鏈
B. β鏈
C. γ鏈
D. δ鏈

正確答案：A. α鏈